Total bilirubin > 3 mg/dl

The above is a clinical trial exclusion criterion. Annotated with entity spans:
[Measurement: Total bilirubin] [Value: > 3 mg/dl]